What organism causes Rhombencephalitis?

Rhombencephalitis caused by Listeria monocytogenes